Patient is able and willing to sign the Informed Consent Form.

The above is a clinical trial inclusion criterion. Annotated with entity spans:
[Post-eligibility: Patient is able and willing to sign the Informed Consent Form].